Clinical trial exclusion criterion:
congestive heart failure New York Heart Association (NYHA) III and IV

Annotated entities:
- Condition: "congestive heart failure"
- Measurement: "New York Heart Association"
- Measurement: "NYHA"
- Value: "III and IV"